Clinical trial inclusion criterion:
FSH levels < 10 mIU/ml

Annotated entities:
- Measurement: "FSH levels"
- Value: "< 10 mIU/ml"